Clinical trial exclusion criterion:
History of spinal cord stenosis or clinical symptoms of lumbar radiculopathy;

Annotated entities:
- Condition: "spinal cord stenosis"
- Temporal: "History"
- Condition: "lumbar radiculopathy"
- Condition: "clinical symptoms"